What is the function of the Spt6 gene in yeast?

These effects are mediated through interactions with histones, transcription factors, and the  RNA polymerase. Spt6 is a highly conserved factor required for normal transcription and chromatin structure. Two lines of evidence suggest that Spt6 also plays a role in rRNA synthesis. We identify the histone H3-H4 chaperone Spt6 as the factor that mediates nucleosome reassembly onto the PHO5, PHO8, ADH2, ADY2, and SUC2 promoters during transcriptional repression.